安非他命引起之精神病不易與思覺失調症（schizophrenia）區別，下列何者不是安非他命引起之精神病的特色？
A. 不適切之情感
B. 視幻覺
C. 活動量增加
D. 性慾增加

正確答案：A. 不適切之情感